Clinical trial inclusion criteria:
Provide written informed consent before beginning any study related activities
Be between age 18 and 55 years
Be able to speak, read and write English and follow simple instructions for completing self-rated scales
Meet DSM-IV criteria for BPD as assessed by the Structured Clinical Interview for DSM-IV Personality Disorders (SCID-II).

Annotated entities:
- Observation: "written informed consent"
- Temporal: "before beginning any study related activities"
- Reference_point: "any study related activities"
- Person: "age"
- Value: "between 18 and 55 years"
- Observation: "able to speak, read and write English"
- Observation: "able to follow simple instructions"
- Condition: "BPD"
- Qualifier: "Meet DSM-IV criteria"
- Procedure: "Structured Clinical Interview for DSM-IV Personality Disorders (SCID-II)"